Clinical trial inclusion criterion:
Respiration rate 12-18 breaths per minute

Entity relations:
- Has_value("Respiration rate", "12-18 breaths per minute")